Patients age 8- 18 years 2) Patients undergoing minimally invasive pectus excavatum repair via Nuss procedure 3) American Society of Anesthesiology Status I-III

The above is a clinical trial inclusion criterion. Annotated with entity spans:
Patients [Person: age] [Value: 8- 18 years] [Line: 2) Patients undergoing minimally invasive pectus excavatum repair via Nuss procedure] [Line: 3) American Society of Anesthesiology Status I-III]